Use of one of the prohibited medications

The above is a clinical trial exclusion criterion. Annotated with entity spans:
[Post-eligibility: Use of one of the prohibited medications]